History of Hepatitis B infection

The above is a clinical trial exclusion criterion. Annotated with entity spans:
History of [Condition: Hepatitis B infection]